Clinical trial exclusion criterion:
QTcF > 500 msec

Entity relations:
- Has_value("QTcF", "> 500 msec")